Not in treatment with anti-resorptive agents (like bisphosphonates and denosumab) for more than 4 consecutive years, in order to reduce the risk of medication-related osteonecrosis of the jaws (Lo et al., 2010).

The above is a clinical trial inclusion criterion. Annotated with entity spans:
[Negation: Not] in treatment with [Drug: anti-resorptive agents] (like [Drug: bisphosphonates] and [Drug: denosumab]) for [Temporal: more than 4 consecutive years,] in order to reduce the risk of medication-related osteonecrosis of the jaws (Lo et al., 2010).